List the blood group antigens, associated with blood type

ABO antigens are highly abundant in many human cell types, including platelets, vascular endotheliums, and red blood cells.